Clinical trial exclusion criterion:
Glucocorticosteroid injection to the diseased achilles tendon within the last 6 months.

Annotated entities:
- Drug: "Glucocorticosteroid"
- Procedure: "injection"
- Condition: "diseased achilles tendon"
- Temporal: "within the last 6 months"